下列何種臨床病症與遺傳性球形紅血球症（hereditary spherocytosis）最不相關？
A. 新生兒黃疸（neonatal hyperbilirubinemia）
B. 膽囊結石（gallstone）
C. 脾臟腫大（splenomegaly）
D. 腎衰竭（renal failure）

正確答案：D. 腎衰竭（renal failure）